Clinical trial inclusion criterion:
Born after a gestation period between 36 and 42 weeks.

Annotated entities:
- Value: "between 36 and 42 weeks"
- Measurement: "gestation period"
- Condition: "Born"